Craniofacial or cardiothoracic malformations

The above is a clinical trial exclusion criterion. Annotated with entity spans:
[Condition: Craniofacial] or [Condition: cardiothoracic malformations]